What is the multisystem inflammatory syndrome in children (MIS-C) associated with COVID-19?

Multisystem inflammatory syndrome in children (MIS-C) is a rare but life-threatening condition that develops in children a few weeks after infection with severe acute respiratory syndrome coronavirus-2 (SARS-CoV-2). It shares clinical features with Kawasaki disease (KD) and KD shock syndrome. Clinical features include persistent fever, severe illness with involvement of multiple organ systems, and elevated inflammatory markers. Therapy is primarily with immunomodulators, suggesting that the disease is driven by post-infectious immune dysregulation. Most children with MIS-C, even those with severe cardiovascular involvement, recover without sequelae. A very similar syndrome has also been reported in adults in association with COVID-19 infection or exposure and is termed multisystem inflammatory syndrome in adults (MIS-A).